Clinical trial exclusion criterion:
Surgery involving the eye, eyebrow, forehead, or frontal scalp near the sensor placement

Annotated entities:
- Procedure: "Surgery"
- Qualifier: "eye"
- Qualifier: "eyebrow"
- Qualifier: "forehead"
- Qualifier: "frontal scalp"
- Non-representable: "near the sensor placement"